Clinical trial exclusion criterion:
Prior treatment with cisplatin before randomization

Entity relations:
- Has_index("before randomization", "randomization")
- Has_temporal("cisplatin", "before randomization")